Where is the klotho protein primarily expressed in the body

Klotho is primarily expressed in the lungs, kidney, lens, cerebellum, trpc6, renal cells and the brain.